willing/able to provide informed consent

The above is a clinical trial inclusion criterion. Annotated with entity spans:
[Informed_consent: willing/able to provide informed consent]